Clinical trial exclusion criterion:
Respiratory pathologies, cardiovascular, renal, diabetes

Annotated entities:
- Condition: "Respiratory pathologies"
- Condition: "cardiovascular"
- Condition: "renal"
- Condition: "diabetes"